diabetic patient;

The above is a clinical trial inclusion criterion. Annotated with entity spans:
[Condition: diabetic] patient;